Clinical trial exclusion criterion:
20. History of cancer, except Stage 1 cervix or nonmelanotic skin cancer, with the possible exception of patients in complete remission

Entity relations:
- Has_temporal("cancer", "History")
- Has_qualifier("skin cancer", "nonmelanotic")
- Has_qualifier("skin cancer", "Stage 1 cervix")
- Has_negation("skin cancer", "except")
- AND("cancer", "skin cancer")